All subjects will have normal cognition at baseline: a Clinical Dementia Rating CDR=0, Global Deterioration Scale GDS<2.

The above is a clinical trial inclusion criterion. Annotated with entity spans:
All subjects will have [Condition: normal cognition] [Temporal: at baseline]: a [Measurement: Clinical Dementia Rating CDR][Value: =0], [Measurement: Global Deterioration Scale GDS][Value: <2].